Patients pregnant or lactating.

The above is a clinical trial exclusion criterion. Annotated with entity spans:
[Pregnancy_considerations: Patients pregnant or lactating].